Clinical trial inclusion criterion:
Current diagnosis of otolaryngeal cancer and undergoing surgery with general anesthesia

Entity relations:
- AND("surgery", "general anesthesia")
- Has_temporal("surgery", "undergoing")
- OR("otolaryngeal cancer", "surgery")